Clinical trial inclusion criterion:
Patients undergoing SSRF at Denver Health Medical Center

Entity relations:
- AND("SSRF", "Denver Health Medical Center")